Patients with a history of gastric bypass surgery.

The above is a clinical trial exclusion criterion. Annotated with entity spans:
Patients with a history of [Procedure: gastric bypass surgery].